Clinical trial exclusion criterion:
Allergy to gabapentin, acetaminophen, codeine, or ibuprofen

Entity relations:
- AND("Allergy", "gabapentin")
- OR("gabapentin", "ibuprofen", "acetaminophen", "codeine")